Las LDL:
1. Transportan colesterol a los tejidos.
2. Transportan colesterol al hígado.
3. Transportan colesterol “bueno”.
4. Niveles bajos en sangre están asociados a menor riesgo de ataque cardiaco.
5. Tienen una densidad alta.

Respuesta correcta: 1. Transportan colesterol a los tejidos.